Clinical trial inclusion criterion:
Documented written informed consent.

Annotated entities:
- Observation: "written informed consent"